一位35歲男性因慢性腹瀉就醫，此症狀在食用麵粉製品後會加劇，少吃會較緩解。血液學檢查顯示血紅素11.5 gm/dL，白血球及血小板正常，而生化學檢查顯示血鈣稍低（2.15 mmol/L，正常2.2～2.5 mmol/L），血清肌 酸酐（creatinine，0.6 mg/dL）、鈉（139 mEq/L）及鉀（3.8 mEq/L）則在正常範圍，血中IgA tissue transglutaminase antibody為陽性。此病人最可能的診斷為何？
A. irritable bowel syndrome
B. celiac disease
C. eosinophilic gastroenteritis
D. Crohn's disease

正確答案：B. celiac disease